下列何者是造成	蛛膜下腔出血（subarachnoid hemorrhage）最常見的原因？
A. 頭部外傷（trauma）
B. 顱內動靜脈血管畸形（arteriovenous malformations）
C. 顱內囊狀（saccular type）動脈瘤
D. 顱內梭狀（fusiform type）動脈瘤

正確答案：C. 顱內囊狀（saccular type）動脈瘤